Patients with a histologically or cytologically proven diagnosis of NSCLC

The above is a clinical trial inclusion criterion. Annotated with entity spans:
Patients with a [Qualifier: histologically] or [Qualifier: cytologically proven] diagnosis of [Condition: NSCLC]